Signed informed consent of study participation

The above is a clinical trial inclusion criterion. Annotated with entity spans:
[Post-eligibility: Signed informed consent of study participation]